Clinical trial inclusion criterion:
=32 weeks gestational age at birth

Annotated entities:
- Measurement: "gestational age at birth"
- Value: "=32 weeks"